Which cancer types are associated with mutations in the TWIST1 gene?

Cancer is caused by uncontrolled cell division. Mutations in TWIST1 are associated with breast cancer, prostate cancer, and lung cancer.